Clinical trial exclusion criterion:
11. Patients with severe rheumatoid arthritis (with more than 20 persistently inflamed joints, or below lower normal limit blood albumin level, or evidence of bone and cartilage damage on x-ray, or inflammation in tissues other than joints) and other collagen vascular diseases.

Entity relations:
- Has_qualifier("rheumatoid arthritis", "severe")
- Has_temporal("inflamed joints", "persistently")
- Has_multiplier("inflamed joints", "more than 20")
- Has_value("blood albumin level", "below lower normal limit")
- Subsumes("severe", "inflamed joints")
- Subsumes("severe", "blood albumin level")
- Subsumes("severe", "bone and cartilage damage")
- Subsumes("severe", "x-ray")
- Subsumes("severe", "inflammation in tissues other than joints")
- OR("rheumatoid arthritis", "collagen vascular diseases")